Liver Transplant Recipients have no acute rejection episodes within 3 months prior to the enrollment and are clinically stable

The above is a clinical trial inclusion criterion. Annotated with entity spans:
[Person: Liver Transplant Recipients] have [Negation: no] [Qualifier: acute] [Condition: rejection episodes] [Temporal: within 3 months prior to the enrollment] and are [Condition: clinically stable]